Patients Level III or greater on the American Society of Anesthesiologists (ASA) physical status classification system (as determined by the anesthesiologist)

The above is a clinical trial exclusion criterion. Annotated with entity spans:
Patients [Value: Level III or greater] on the [Measurement: American Society of Anesthesiologists (ASA) physical status] classification system (as determined by the anesthesiologist)